Current or past history of aspirin-induced asthma or hypersensitivity to NSAIDs.

The above is a clinical trial exclusion criterion. Annotated with entity spans:
[Temporal: Current] or [Temporal: past history] of [Qualifier: aspirin-induced] [Condition: asthma] or [Condition: hypersensitivity to NSAIDs].